Clinical trial exclusion criterion:
Hypertensive (>160/100 mmHg)

Entity relations:
- Has_value("Hypertensive", ">160/100 mmHg")
- multi("Hypertensive", "Hypertensive")